Illiterate

The above is a clinical trial exclusion criterion. Annotated with entity spans:
[Observation: Illiterate]